Patients' CMV-DNA = 1000cp/ml in treatment group and being negative in prophylactic group.

The above is a clinical trial inclusion criterion. Annotated with entity spans:
Patients' [Measurement: CMV-DNA] [Value: = 1000cp/ml] in [Person: treatment group] and being [Value: negative] in [Person: prophylactic group].